untreated vaginitis

The above is a clinical trial exclusion criterion. Annotated with entity spans:
[Condition: untreated vaginitis]